Persons presently receiving or having a recent history of receiving (within the past six months) any medication or therapeutic modality that affects the immune system such as allergy shots, immune globulin, interferon, immunomodulators, radiation therapy, cytotoxic drugs or drugs known to be frequently associated with significant major organ toxicity, or systemic corticosteroids (oral or injectable). Inhaled and topical corticosteroids are allowed.

The above is a clinical trial exclusion criterion. Annotated with entity spans:
Persons presently receiving or having a recent history of receiving ([Temporal: within the past six months]) [Drug: any medication] or [Procedure: therapeutic modality] that [Qualifier: affects the immune system] such as [Drug: allergy shots], [Drug: immune globulin], [Drug: interferon], [Drug: immunomodulators], [Procedure: radiation therapy], [Drug: cytotoxic drugs] or [Drug: drugs known to be frequently associated with significant major organ toxicity], or [Drug: systemic corticosteroids] ([Qualifier: oral] or [Qualifier: injectable]). [Grammar_Error: Inhaled and topical corticosteroids are allowed.]